History or current evidence of wasting, autoimmune (such as rheumatoid arthritis and systemic lupus erythematosus) or connective tissue diseases

The above is a clinical trial exclusion criterion. Annotated with entity spans:
[Temporal: History] or [Temporal: current] evidence of [Observation: wasting], [Condition: autoimmune] (such as [Condition: rheumatoid arthritis] and [Condition: systemic lupus erythematosus]) or [Condition: connective tissue diseases]